Clinically significant delusions for which either 1) the frequency of delusions as assessed by the NPI is 'Very frequently', or 2) the frequency of delusions as assessed by the NPI is 'Frequently' AND the severity of the delusions as assessed by the NPI is 'Moderate', or 'Marked'

The above is a clinical trial exclusion criterion. Annotated with entity spans:
[Qualifier: Clinically significant] [Condition: delusions] for which either 1) the [Multiplier: frequency of delusions] as assessed by the [Measurement: NPI] is '[Value: Very frequently]', or 2) the [Multiplier: frequency of delusions] as assessed by the [Measurement: NPI] is '[Value: Frequently]' AND the [Qualifier: severity of the delusions] as assessed by the [Measurement: NPI] is '[Value: Moderate]', or '[Value: Marked]'